Clinical trial exclusion criterion:
Pregnant or nursing

Entity relations:
- OR("Pregnant", "nursing")